Recipient of a French social security scheme

The above is a clinical trial inclusion criterion. Annotated with entity spans:
[Non-query-able: Recipient of a French social security scheme]